某 30 歲男性，近半年來變得退縮，常說有人跟蹤他、要害他、疑神疑鬼，有時自言自語好像在和別 人對話。關於這個男性的下列敘述，那項最正確？
A. 心理治療的第一選擇是精神分析
B. 藥物治療的第一選擇是三環抗鬱劑
C. 他的一等親有類似病症的機率約 10%
D. \ 磁振掃描（MRI）是診斷必要的檢查

正確答案：C. 他的一等親有類似病症的機率約 10%